History or known presence of potential metabolic causes of myelopathy (e.g., untreated vitamin B12 deficiency)

The above is a clinical trial exclusion criterion. Annotated with entity spans:
History or known presence of potential [Condition: metabolic causes] of [Condition: myelopathy] (e.g., [Qualifier: untreated] [Condition: vitamin B12 deficiency])